下列何種藥物之抗藥菌，其抗藥機轉並非使用 Tet efflux pump 作用而排出菌體外，適用於嚴重之腹腔感染？
A. Doxycycline
B. Tetracycline
C. Minocycline
D. Tigecycline

正確答案：D. Tigecycline